Clinical trial exclusion criterion:
Any other primary DSM-IV diagnosis; DSM-IV criteria for body dysmorphic disorder, bipolar affective disorder, schizophrenia, psychotic disorder, current alcohol/substance abuse.

Entity relations:
- Has_qualifier("diagnosis", "DSM-IV")
- Has_qualifier("diagnosis", "primary")
- AND("DSM-IV criteria", "body dysmorphic disorder")
- OR("body dysmorphic disorder", "alcohol abuse", "psychotic disorder,", "schizophrenia", "bipolar affective disorder", "substance abuse")